某病患結膜的細胞學檢查，發現刮下來的結膜細胞胞質內有嗜鹼性包涵體（basophilic inclusion bodies），該病人最可能患有什麼疾病？
A. 砂眼（Trachoma）
B. 淋菌性結膜炎（Gonococcal conjunctivitis）
C. 春季角結膜炎（Vernal keratoconjunctivitis）
D. 巨大乳頭狀結膜炎（Giant papillary conjunctivitis）

正確答案：A. 砂眼（Trachoma）